Clinical trial exclusion criterion:
Albumin < 3g/dl or platelet count < 75 x 103/mL

Entity relations:
- Has_value("platelet count", "< 75 x 103/mL")
- Has_value("Albumin", "< 3g/dl")